Clinical trial exclusion criterion:
Known hypersensitivity to egg, soybean proteins, peanut proteins, corn or corn products, or to any of the active substances or excipients

Annotated entities:
- Condition: "hypersensitivity"
- Drug: "egg"
- Drug: "soybean proteins"
- Drug: "peanut proteins"
- Drug: "corn"
- Drug: "corn products"
- Drug: "active substances"
- Drug: "excipients"